Cardiac and coronary diseases with pregnancy

The above is a clinical trial exclusion criterion. Annotated with entity spans:
[Condition: Cardiac] and [Condition: coronary diseases] with [Condition: pregnancy]